Clinical trial inclusion criterion:
SI joint pathology is the predominant source of pain

Annotated entities:
- Condition: "SI joint pathology"
- Non-representable: "is the predominant source of pain"